Clinical trial inclusion criterion:
Serum or plasma potassium level greater than or equal to 3.5 meq/L

Entity relations:
- Has_qualifier("potassium level", "Serum")
- Has_value("potassium level", "greater than or equal to 3.5 meq/L")
- OR("Serum", "plasma")